Clinical trial exclusion criterion:
11. Infectious disease screen is positive for HIV or Hepatitis A, B or C.

Entity relations:
- OR("HIV", "Hepatitis B", "Hepatitis A", "Hepatitis C")